6. Patients with HIV neuropathy must have had HIV, subjective symptoms of painful peripheral neuropathy, and daily painful symptoms of at least 3 months' duration

The above is a clinical trial inclusion criterion. Annotated with entity spans:
6. Patients with [Condition: HIV neuropathy] must have had [Condition: HIV], [Condition: subjective symptoms] of [Qualifier: painful] [Condition: peripheral neuropathy], and [Multiplier: daily] [Condition: painful symptoms] of [Temporal: at least 3 months' duration]